直腸乙狀結腸交接處（rectosigmoid junction）位於下列那個節段？
A. 第一薦椎（S1）
B. 第二薦椎（S2）
C. 第三薦椎（S3）
D. 第四薦椎（S4）

正確答案：C. 第三薦椎（S3）